Clinical trial exclusion criterion:
Hunt Hess Grade 5 SAH

Annotated entities:
- Measurement: "Hunt Hess Grade"
- Value: "5"
- Condition: "SAH"